Clinical trial exclusion criterion:
patients with an absolute indication for administration of antibiotics at the moment of ICU admission (meningitis, pneumonia) or a chronic infection for which long-term antibiotic treatment is necessary (endocarditis, osteo-articular infections, mediastinitis, deep abscesses, pneumocystis infection, toxoplasmosis, tuberculosis)

Annotated entities:
- Visit: "ICU"
- Drug: "antibiotics"
- Condition: "meningitis"
- Condition: "pneumonia"
- Condition: "indication"
- Condition: "chronic infection"
- Qualifier: "long-term"
- Procedure: "antibiotic treatment"
- Condition: "endocarditis"
- Condition: "osteo-articular infections"
- Condition: "mediastinitis"
- Condition: "deep abscesses"
- Condition: "pneumocystis infection"
- Condition: "toxoplasmosis"
- Condition: "tuberculosis"